Clinical trial exclusion criterion:
Be allergic to amikacin

Annotated entities:
- Condition: "allergic"
- Drug: "amikacin"